Current dialysis treatment.

The above is a clinical trial exclusion criterion. Annotated with entity spans:
[Temporal: Current] [Procedure: dialysis treatment].